Contraindication to bariatric surgery

The above is a clinical trial exclusion criterion. Annotated with entity spans:
[Condition: Contraindication] to [Procedure: bariatric surgery]